Clinical trial exclusion criterion:
1. Patient with equivocal diagnosis of rupture of membranes

Annotated entities:
- Parsing_Error: "1."
- Condition: "rupture of membranes"
- Negation: "equivocal"